關於細菌致病島（pathogenicity island）之敘述，下列何者錯誤？
A. 可位於細菌的染色體（chromosome）或質體（plasmid）中
B. 不存在於轉位子（transposon）之中
C. 可被單一因子活化，例如：溫度或pH值的改變
D. 由多數基因所組成，可製造多種致病因子（virulence factors）

正確答案：B. 不存在於轉位子（transposon）之中